Clinical trial exclusion criterion:
history or records of immunosuppressive therapy (with the exception of topical corticosteroids) for more than 14 days and within 6 months of vaccination

Annotated entities:
- Procedure: "immunosuppressive therapy"
- Procedure: "topical corticosteroids"
- Negation: "exception"
- Temporal: "for more than 14 days of vaccination"
- Temporal: "within 6 months of vaccination"
- Reference_point: "vaccination"